Clinical trial exclusion criterion:
Has had major psychiatric illness and/or substance abuse problems during the past 12 months (including hospitalization or periods of work disability) that in the opinion of the investigator would preclude participation

Entity relations:
- Has_qualifier("psychiatric illness", "major")
- Subsumes("psychiatric illness", "hospitalization")
- Has_temporal("psychiatric illness", "during the past 12 months")
- Has_temporal("substance abuse", "during the past 12 months")
- OR("hospitalization", "work disability")